Which application is the backbone of BioPAXViz?

BioPAXViz is a Cytoscape (version 3) application providing a comprehensive framework for metabolic pathway visualization.